Pregnant female, as determined for women less than 60 years old by a positive urine pregnancy test during the screening window.

The above is a clinical trial exclusion criterion. Annotated with entity spans:
[Condition: Pregnant] [Person: female], as determined for [Person: women] [Value: less than 60 years] [Person: old] by a [Value: positive] [Measurement: urine pregnancy test] [Temporal: during the screening window].